下列前臂肌肉中，何者的位置較深？
A. 屈指淺肌（flexor digitorum superficialis）
B. 旋前圓肌（pronator teres）
C. 橈側屈腕肌（flexor carpi radialis）
D. 尺側屈腕肌（flexor carpi ulnaris）

正確答案：A. 屈指淺肌（flexor digitorum superficialis）